Is healthy on the basis of physical examination, medical history, electrocardiogram (ECG), and vital signs measurement performed at screening

The above is a clinical trial inclusion criterion. Annotated with entity spans:
Is [Condition: healthy] on the basis of [Procedure: physical examination], [Temporal: medical history], [Procedure: electrocardiogram (ECG)], and [Procedure: vital signs measurement] performed [Temporal: at screening]